Which key gene is involved in interstitial 6q25 microdeletion syndrome?

The critical region for the interstitial 6q microdeletion phenotype was mapped to 6q24-6q25, particularly the 6q25.3 region containing the genes ARID1B and ZDHHC14.